¿En qué tipo de técnica puede ser encuadrado el Cuestionario Multifásico de Evaluación de la Personalidad de Minnesota?
1. De Autoinforme.
2. Técnicas Escalares.
3. Como una técnica de Autorregistro.
4. Dentro de las técnicas Proyectivas.
5. De Constructos personales.

Respuesta correcta: 1. De Autoinforme.